Clinical trial exclusion criterion:
Formal indication to oral anticoagulation beside atrial fibrillation (mechanic heart valves, recurrent thrombophlebitis, antiphospholipid syndrome)

Entity relations:
- AND("indication", "oral anticoagulation")
- Subsumes("atrial fibrillation", "mechanic heart valves")
- OR("mechanic heart valves", "recurrent thrombophlebitis", "antiphospholipid syndrome")